How many Groucho-related genes (GRG) are contained in the mouse genome?

It spans approximately 7 kb on chromosome 10 and consists of seven exons. The groucho-related genes (Grg) of the mouse comprise at least four family members.